Glomerular primary focal and segmental sclerosis

The above is a clinical trial exclusion criterion. Annotated with entity spans:
[Condition: Glomerular primary focal] and segmental sclerosis